Stroke or coronary revascularization in the past 6 months.

The above is a clinical trial exclusion criterion. Annotated with entity spans:
[Procedure: Stroke] or [Procedure: coronary revascularization] [Temporal: in the past 6 months].